Clinical trial exclusion criterion:
Unstable angina;

Annotated entities:
- Condition: "Unstable angina"